維生素B12是造血的重要元素之一，以下對維生素B12的敘述何者錯誤？
A. 人體每日所需維生素B12的量相當少（約1～3微克）
B. 在完全無法經由飲食吸收維生素B12的狀況下，如果沒有另外補充，通常需要3～4年才能消耗完身體中的儲存量
C. 哺乳中的婦女若有維生素B12缺乏容易造成嬰兒生長發育遲滯
D. 蔬果類食物含有豐富的維生素B12

正確答案：D. 蔬果類食物含有豐富的維生素B12